李先生因呼吸困難而到醫院就診，在診間醫師問完病史後，就作身體診察，其中包括了abdominojugular reflex，結果發現原本無異樣的頸靜脈有明顯的鼓漲，至少在鎖骨上超過5公分。下列敘述何者最恰當：
A. 大血管動脈端有pressure overload
B. 有volume overload
C. 為紐約心臟協會的心衰竭功能分類（NYHA functional classification）的第四級
D. 有左側心衰竭

正確答案：B. 有volume overload